有關胃腺癌之分期，TNM中"T"代表：
A. 腫瘤位置
B. 腫瘤大小
C. 腫瘤侵犯深度
D. 腫瘤肉眼觀

正確答案：C. 腫瘤侵犯深度